Clinical trial inclusion criterion:
All infertile women treated with intracytoplasmic sperm injection (ICSI)/Fertilization in Vitro and Embryo Transfer (FIVET)

Annotated entities:
- Condition: "infertile"
- Person: "women"
- Procedure: "intracytoplasmic sperm injection (ICSI)"
- Procedure: "Fertilization in Vitro and Embryo Transfer (FIVET)"